Entre los objetivos específicos que ha elaborado con el fin de hacer una intervención de educación para la salud, encaminada a facilitar a las personas de 65 y más años la incorporación de actividades preventivas para el golpe de calor en los autocuidados diarios, identifique el que está INCORRECTAMENTE formulado:
1. Enseñar a las personas de 65 y más años los signos y los síntomas del golpe de calor, durante las dos primeras sesiones, de las 10 totales.
2. Seleccionar el vestido-calzado pertinente para utilizar durante la época de calor en el lugar de la residencia, al finalizar la 3ª sesión.
3. Enunciar las actividades que más se hacen cada día y que están influenciadas por el exceso de calor, al finalizar todas las sesiones.
4. Señalar en una lista de 15 alimentos, los que facilitan la hidratación corporal, al final de la 2ª sesión y con un máximo de 3 errores.
5. Argumentar cada una de las acciones que hay que hacer cuando ocurra un golpe de calor, pasada una semana desde el final de la intervención.

Respuesta correcta: 1. Enseñar a las personas de 65 y más años los signos y los síntomas del golpe de calor, durante las dos primeras sesiones, de las 10 totales.